Biopsy-proven LN Class III/IV±V (ISN/RPS 2003), with biopsy performed within 12 weeks of randomization.

The above is a clinical trial inclusion criterion. Annotated with entity spans:
Biopsy-proven [Condition: LN] [Qualifier: Class III/IV±V] (ISN/RPS 2003), with [Procedure: biopsy] performed [Temporal: within 12 weeks] of randomization.